Psychiatric disorders other than insomnia, PTSD and specific phobias; including bipolar and psychotic disorders and meeting criteria for DSM-5 moderate alcohol or drug use disorders within the past year.

The above is a clinical trial exclusion criterion. Annotated with entity spans:
[Condition: Psychiatric disorders] [Negation: other] than [Condition: insomnia], [Condition: PTSD] and specific [Condition: phobias]; including [Condition: bipolar] and [Condition: psychotic disorders] and meeting criteria for [Qualifier: DSM-5] [Qualifier: moderate] [Condition: alcohol] or [Condition: drug use disorders] within the [Temporal: past year].